Participation to other studies

The above is a clinical trial exclusion criterion. Annotated with entity spans:
[Competing_trial: Participation to other studies]